Clinical trial inclusion criterion:
Patients who have received at least 1 transfusion per year in the last 2 years and who are expected to have a continuing requirement (based on Investigator's judgement) during the duration of the trial

Entity relations:
- Has_multiplier("transfusion", "at least 1 per year")
- Has_temporal("transfusion", "in the last 2 years")
- Has_temporal("expected to have a continuing requirement", "during the duration of the trial")